Clinical trial exclusion criterion:
15. Any other condition(s) that would compromise the safety of the subject or compromise the quality of the clinical study, as judged by the Investigator

Annotated entities:
- Parsing_Error: "15."
- Non-query-able: "Any other condition(s) that would compromise the safety of the subject or compromise the quality of the clinical study, as judged by the Investigator"
- Context_Error: "Any other condition(s) that would compromise the safety of the subject or compromise the quality of the clinical study, as judged by the Investigator"
- Post-eligibility: "Any other condition(s) that would compromise the safety of the subject or compromise the quality of the clinical study, as judged by the Investigator"
- Subjective_judgement: "Any other condition(s) that would compromise the safety of the subject or compromise the quality of the clinical study, as judged by the Investigator"